Clinical trial inclusion criteria:
Adult (= 18 years old) subjects with chronic genotype 1 HCV and NCI with a GDS greater than or equal to 0.5 (n=60).
Presence of chronic HCV infection based on chart review will be defined as positive for anti-HCV antibody or HCV RNA at least 6 months before screening.
For the HIV/HCV co-infected group only, subjects must have HIV. HIV status will be obtained through self report. Self report will be confirmed at screening using a HIV-1 point of care test. In the event that point of care test and self-report are discordant, then HIV status will be confirmed by a licensed Western blot or a second antibody test.
HIV/HCV co-infected subjects (n=12) must also have a HIV RNA measurement <50 copies/mL at the pre-treatment visit.
Platelets >150,000
Aspartate aminotransferase (AST)/Alanine aminotransferase (ALT) <10x upper limit of normal
Creatinine clearance >30 milliliters/minute/1.73 centimeter squared

Annotated entities:
- Person: "Adult"
- Value: "= 18 years old"
- Person: "old"
- Qualifier: "genotype 1"
- Temporal: "chronic"
- Condition: "HCV"
- Condition: "NCI"
- Measurement: "GDS"
- Value: "greater than or equal to 0.5"
- Temporal: "chronic"
- Condition: "HCV infection"
- Measurement: "anti-HCV antibody"
- Value: "positive"
- Measurement: "HCV RNA"
- Temporal: "at least 6 months before screening"
- Non-representable: "For the HIV/HCV co-infected group only, subjects must have HIV. HIV status will be obtained through self report. Self report will be confirmed at screening using a HIV-1 point of care test. In the event that point of care test and self-report are discordant, then HIV status will be confirmed by a licensed Western blot or a second antibody test."
- Condition: "HIV"
- Condition: "HCV"
- Condition: "co-infected"
- Measurement: "HIV RNA measurement"
- Value: "<50 copies/mL"
- Temporal: "at the pre-treatment visit"
- Measurement: "Platelets"
- Value: ">150,000"
- Measurement: "Aspartate aminotransferase (AST)"
- Measurement: "Alanine aminotransferase (ALT)"
- Value: "<10x upper limit of normal"
- Measurement: "Creatinine clearance"
- Value: ">30 milliliters/minute/1.73 centimeter squared"